下列何者不是缺血性細胞傷害（Ischemic injury）的變化特徵？
A. pH 值降低
B. 醣類減少
C. 蛋白質減少
D. 脂質減少

正確答案：D. 脂質減少